Clinical trial inclusion criterion:
Normal acquired/inherited thrombophilia profile: LAC, ACA IgG/IgM, Prot S, Antithrombin III, beta-2 glycoprotein, Factors V, II, MTHFR.

Annotated entities:
- Measurement: "thrombophilia profile"
- Value: "Normal"
- Measurement: "LAC"
- Measurement: "ACA IgG"
- Measurement: "Prot S"
- Measurement: "Antithrombin III"
- Measurement: "ACA IgM"
- Measurement: "beta-2 glycoprotein"
- Measurement: "Factors V"
- Measurement: "Factors II"
- Measurement: "MTHFR"